Clinical trial exclusion criterion:
Preoperative Hemoglobin <U+2266>11 g/dl

Annotated entities:
- Temporal: "Preoperative"
- Measurement: "Hemoglobin"
- Value: "<U+2266>11 g/dl"